Clinical trial exclusion criterion:
Antecedent of epileptic seizure

Annotated entities:
- Condition: "epileptic seizure"
- Temporal: "Antecedent"